Las reacciones de alquilación de Friedel-Crafts conducen a productos que:
1. Facilitan las reacciones de diazotación.
2. Facilitan las reacciones de formación de éteres.
3. Activan el anillo aromático frente a otras sustituciones.
4. Desactivan el anillo aromático frente a otras sustituciones.
5. Ninguna de las anteriores.

Respuesta correcta: 3. Activan el anillo aromático frente a otras sustituciones.